Clinical trial inclusion criterion:
Multiple gated acquisition (MUGA), echocardiogram, cardiac MRI, and/or pulmonary function tests (PFT) performed and reviewed by transplant center (for individuals with an ejection fraction and diffusing capacity [DLCO] of 40-50%, the appropriate cardiology or pulmonary consultations should be considered if the individual has severe heart or lung disease at the initiation of therapy)

Entity relations:
- Has_qualifier("Multiple gated acquisition (MUGA)", "reviewed by transplant center")
- OR("Multiple gated acquisition (MUGA)", "echocardiogram", "cardiac MRI", "pulmonary function tests (PFT)")